La velocidad del flujo sanguíneo es máxima en:
1. Grandes arterias.
2. Arterias de distribución.
3. Arteriolas.
4. Capilares.
5. Vénulas.

Respuesta correcta: 1. Grandes arterias.